Clinical trial inclusion criterion:
Mexican-american

Annotated entities:
- Person: "Mexican-american"